Participated in other clinical studies in the last 30 days

The above is a clinical trial exclusion criterion. Annotated with entity spans:
[Observation: Participated in other clinical studies] in [Temporal: the last 30 days]